Clinical trial exclusion criterion:
Radiation exposures exceeding annual Rad Worker limits.

Entity relations:
- Has_value("Radiation exposures", "exceeding annual Rad Worker limits")